What are the currently FDA approved monoclonal antibodies for myeloma?

The US Food and Drug Administration approved MoAbs, include belantamab mafodotin, daratumumab, elotuzumab, and isatuximab.